History of hypersensitivity reaction to apixaban

The above is a clinical trial exclusion criterion. Annotated with entity spans:
History of [Condition: hypersensitivity] reaction to [Drug: apixaban]